La reacción de una amina primaria con cloroformiato de terc-butilo en presencia de una base débil como la piridina forma:
1. Una piperidina.
2. Un alcohol.
3. Una olefina.
4. Un uretano.

Respuesta correcta: 4. Un uretano.